以下何者不是 cerebral cortex 之調節功能？
A. Language comprehension
B. Respiration, circulation & digestion
C. Final sensory perception
D. Voluntary movement

正確答案：B. Respiration, circulation & digestion